Clinical trial exclusion criterion:
Suicidal patients and/or severe automutilation behavior and/or psychotic symptoms and/or lack of event memory.

Entity relations:
- Has_qualifier("automutilation behavior", "severe")
- OR("Suicidal", "lack of event memory", "automutilation behavior", "psychotic symptoms")